operating time varies 1-4h,and extubation after the operation.

The above is a clinical trial inclusion criterion. Annotated with entity spans:
[Measurement: operating time] varies [Value: 1-4h],and [Procedure: extubation] [Temporal: after the operation].